Clinical trial inclusion criterion:
Midsubstance pain in the achilles tendon

Annotated entities:
- Condition: "Midsubstance pain"
- Qualifier: "achilles tendon"